Clinical trial inclusion criterion:
SCH (TSH: upper limits of normal (ULN) -10mIU/L, and FT4 level within reference range).

Entity relations:
- Has_value("FT4 level", "within reference range")
- Has_value("TSH", "upper limits of normal (ULN) -10mIU/L")
- Subsumes("SCH", "TSH")
- Subsumes("SCH", "FT4 level")